Clinical trial exclusion criterion:
hiatal hernia repair with posterior cruroplasty

Entity relations:
- AND("repair", "hiatal hernia")
- AND("repair", "posterior cruroplasty")